有關罹患重鬱症的患者可能會出現 melancholic 特徵，下列敘述何者正確？
A. 在晚上呈現更憂鬱情緒
B. 與自主神經系統及內分泌系統之改變無關
C. 肇因於外在壓力事件
D. 主要特徵為缺乏興趣（anhedonia）、早醒與體重下降等

正確答案：D. 主要特徵為缺乏興趣（anhedonia）、早醒與體重下降等